Clinical trial exclusion criterion:
patients without health insurance,

Annotated entities:
- Negation: "without"
- Person: "health insurance"